What is the function of cryptochrome-1 in mouse?

Cryptochrome-1 (Cry1) is an essential component of the central and peripheral circadian clocks for generation of circadian rhythms in mice.